Diabetic patients

The above is a clinical trial exclusion criterion. Annotated with entity spans:
[Condition: Diabetic] patients